Clinical trial exclusion criterion:
History of life threatening allergy, anaphylactic reaction, or systemic response to human plasma derived products.

Entity relations:
- Has_qualifier("life threatening allergy", "life threatening")
- Has_qualifier("products", "human plasma derived")
- AND("systemic response to human plasma derived products", "products")
- Has_temporal("life threatening allergy", "History")
- OR("life threatening allergy", "systemic response to human plasma derived products", "anaphylactic reaction")